En los mamíferos, los receptores de tipo Toll (TLR) son receptores:
1. De señalización.
2. Antigénicos.
3. De alelos de histocompatibilidad.
4. De fagocitosis.
5. De quimiocinas.

Respuesta correcta: 1. De señalización.